Clinical trial exclusion criterion:
Presence, or removal within the last 12 hours, of an epidural or spinal catheter, or recent (within the last 12 hours) epidural or spinal anesthesia/procedures

Entity relations:
- Has_temporal("Presence of an epidural", "within the last 12 hours")
- Subsumes("recent", "within the last 12 hours")
- Has_temporal("epidural anesthesia", "recent")
- OR("Presence of an epidural", "removal of a spinal catheter", "removal of an epidural", "Presence of a spinal catheter")
- OR("epidural anesthesia", "spinal anesthesia")